Cushing's disease is associated with a tumor in what part of the body?

Cushing's disease is associated with a tumor in the pituitary gland